Clinical trial exclusion criterion:
8. Evidence of significant airway and/or parenchymal lung disease.

Annotated entities:
- Parsing_Error: "8."
- Condition: "airway disease"
- Condition: "parenchymal lung disease"
- Qualifier: "significant"
- Subjective_judgement: "significant"
- Undefined_semantics: "significant"